恙蟲病（scrub typhus）是由具有傳染性的恙蟎叮咬後造成的疾病，患者在叮咬處會形成特有的洞穿式皮膚潰瘍型焦痂（escar）。此焦痂形成的主要原因為：
A. 立克次體感染血管內皮細胞引起血管炎與血管栓塞
B. 立克次體感染皮膚上皮細胞，造成上皮細胞壞死，形成潰瘍
C. 立克次體感染皮膚上皮細胞，造成上皮細胞壞死，引起繼發性細菌感染
D. 立克次體感染皮膚皮下神經元細胞，造成痛覺喪失，引起繼發性細菌感染

正確答案：A. 立克次體感染血管內皮細胞引起血管炎與血管栓塞